下列「狂犬病暴露後的疫苗注射」及建議時間，何者正確？
A. 第0、3、7、14、28天，共5次
B. 第0、7、14、28天，共4次
C. 第0、7、28天，共3次
D. 第0、14、28天，共3次

正確答案：A. 第0、3、7、14、28天，共5次